Clinical trial inclusion criterion:
Body mass index: > 18.5 kg/m2

Annotated entities:
- Measurement: "Body mass index"
- Value: "> 18.5 kg/m2"